Clinical trial exclusion criterion:
ASA IV-V

Annotated entities:
- Measurement: "ASA"
- Value: "IV-V"